Clinical trial exclusion criterion:
10. Unexplained, undiagnosed abnormal bleeding per vagina, bleeding per vagina during or following vaginal intercourse, or gynaecologic surgery within 90 days prior to enrollment

Entity relations:
- Has_index("within 90 days prior to enrollment", "enrollment")
- Has_temporal("gynaecologic surgery", "within 90 days prior to enrollment")
- Has_temporal("bleeding per vagina", "during vaginal intercourse")
- Has_qualifier("bleeding per vagina", "undiagnosed")
- AND("undiagnosed", "Unexplained")
- AND("Unexplained", "abnormal")
- OR("during vaginal intercourse", "following vaginal intercourse")
- OR("bleeding per vagina", "bleeding per vagina", "gynaecologic surgery")